Clinical trial exclusion criterion:
Genetic malignant hyperthermia

Annotated entities:
- Qualifier: "Genetic"
- Condition: "malignant hyperthermia"